What is the biological role of Neddylation?

Neddylation is a post-translational protein modification that is tightly linked to ubiquitination and thereby protein degradation.Proteins in the neddylation pathway have also been linked to regulating ddr.Blocking neddylation could be a novel strategy for mitigating immune-mediated disease processes.